Clinical trial exclusion criterion:
seizures or epilepsy in the past

Annotated entities:
- Value: "seizures"
- Value: "epilepsy"
- Temporal: "in the past"